OA cohort: Diagnosis of osteoarthritis made by physician.

The above is a clinical trial inclusion criterion. Annotated with entity spans:
[Condition: OA] cohort: Diagnosis of [Condition: osteoarthritis] [Observation: made by physician].